Clinical trial inclusion criterion:
Blasts < 1,000/µL in peripheral blood (PB) on day 8

Annotated entities:
- Line: "Blasts < 1,000/µL in peripheral blood (PB) on day 8"
- Measurement: "Blasts"
- Value: "< 1,000/µL"
- Qualifier: "peripheral blood"
- Qualifier: "PB"
- Temporal: "on day 8"